provide informed consent either personally or by an authorized representative.

The above is a clinical trial inclusion criterion. Annotated with entity spans:
[Informed_consent: provide informed consent either personally or by an authorized representative].